一位 40 歲女性，因多囊性卵巢不孕多年，月經不規則，月經第 3 天的血液分析為 FSH：8 mIU/mL， LH：30 mIU/mL，testosterone：75 ng/dL，超音波下可見雙側多囊性卵巢，子宮內膜厚度為 2.5 cm，在開始誘導排卵前，下列何種檢查是優先需要的？
A. 乳房檢查
B. 腹腔鏡檢查
C. 子宮內膜切片
D. 血中膽固醇，三酸甘油酯

正確答案：C. 子宮內膜切片